Clinical trial exclusion criterion:
If the subject is assured of an abstinence throughout the trial period.(e.g. clergy)

Annotated entities:
- Pregnancy_considerations: "If the subject is assured of an abstinence throughout the trial period.(e.g. clergy)"